有關慢性阻塞性肺病（COPD）病患，其肺功能測試的結果，下列何者最為正確？
A. 肺活量（vital capacity）增加
B. 全肺量（total lung capacity）增加
C. 肺餘量（residual volume）下降
D. 最大自主性換氣量（maximal voluntary ventilation）增加

正確答案：B. 全肺量（total lung capacity）增加